一位 36 歲女性，因近來常覺頭痛。其血壓測起來是 180/110 mmHg。但身體其他部位並未發現明顯異常。腹部電腦斷層掃描發現她右側腎上腺有一個 2 cm的腫瘤。而血液中，發現K+異常的低。下列何者可能偏高？
A. ACTH
B. aldosterone
C. renin
D. catecholamine

正確答案：B. aldosterone